Clinical trial exclusion criterion:
Anticipated postoperative positive pressure ventilation

Annotated entities:
- Temporal: "postoperative"
- Procedure: "positive pressure ventilation"
- Mood: "Anticipated"